Clinical trial exclusion criterion:
Alpha-1 antitrypsin deficiency

Annotated entities:
- Condition: "Alpha-1 antitrypsin deficiency"